下列何者是負責張口的主要肌肉？
A. 翼外肌（lateral pterygoid）
B. 顳肌（temporalis）
C. 嚼肌（masseter）
D. 顴大肌（zygomaticus major）

正確答案：A. 翼外肌（lateral pterygoid）